Clinical trial inclusion criterion:
Patients who responded inadequately (a score of >18 on the MADRS) to first-line antidepressant treatment of 4 week duration

Entity relations:
- Has_qualifier("antidepressant", "first-line")
- Has_value("MADRS", "score of >18")
- AND("responded inadequately", "MADRS")
- AND("responded inadequately", "antidepressant")
- Has_temporal("antidepressant", "of 4 week")